Have symptoms of no longer than 7 days at point of hospitalisation.

The above is a clinical trial inclusion criterion. Annotated with entity spans:
Have [Condition: symptoms] of [Temporal: no longer than 7 days at point of hospitalisation].